Clinical trial exclusion criterion:
HIV co-infection

Annotated entities:
- Condition: "co-infection"
- Qualifier: "HIV"